Sufficiently socially unstable as to preclude participation (e.g. homeless)

The above is a clinical trial exclusion criterion. Annotated with entity spans:
[Qualifier: Sufficiently] [Condition: socially unstable] as to preclude participation (e.g. homeless)